El aclaramiento hepático de un fármaco, eliminado fundamentalmente por metabolismo, que presenta un alto grado de extracción hepática y una elevada unión a proteínas plasmáticas:
1. Está significativamente influenciado por el flujo sanguíneo hepático.
2. Está significativamente influenciado por cambios en el grado de unión a proteínas plasmáticas.
3. Está significativamente influenciado tanto por el flujo sanguíneo hepático como por cambios en el grado de unión a proteínas plasmáticas.
4. No se verá influenciado ni por el flujo sanguíneo hepático ni por cambios en el grado de unión a proteínas plasmáticas.
5. Dependerá de la biodisponibilidad absoluta del fármaco.

Respuesta correcta: 1. Está significativamente influenciado por el flujo sanguíneo hepático.